Patients with active alcohol dependence

The above is a clinical trial exclusion criterion. Annotated with entity spans:
Patients with active [Condition: alcohol dependence]